Clinical trial inclusion criterion:
Diagnosed with cutaneous vasculitis, urticaria, psoriasis, acne, bullous skin diseases, sterile pustulosis, leprosy, pneumocystis pneumonia and any other patients who need dapsone administration.

Entity relations:
- OR("cutaneous vasculitis", "urticaria", "psoriasis", "acne", "bullous skin diseases", "sterile pustulosis", "leprosy", "pneumocystis pneumonia", "dapsone")